Clinical trial inclusion criterion:
-Patients residing in the following clinical states wit! be considered: A. Rising PSA: Patients with a history of localized disease who have undergone definitive radiation or surgery. These patients must demonstrate progression of disease biochemically as outlined below. Patients in this group may not have radiographically evident disease.

Entity relations:
- Has_value("PSA", "Rising")
- Has_qualifier("radiation", "definitive")
- Has_qualifier("progression of disease", "biochemically")
- Has_temporal("localized disease", "history of")
- AND("localized disease", "radiation")
- Has_qualifier("disease", "radiographically evident")
- OR("radiation", "surgery")